Prostate volume = 100 cc

The above is a clinical trial inclusion criterion. Annotated with entity spans:
[Measurement: Prostate volume] [Value: = 100 cc]